Clinical trial exclusion criterion:
Inflammatory bowel disease that is uncontrolled or on active treatment (Crohn's disease, ulcerative colitis)

Entity relations:
- Subsumes("Inflammatory bowel disease", "Crohn's disease")
- Has_qualifier("Inflammatory bowel disease", "uncontrolled")
- OR("Crohn's disease", "ulcerative colitis")
- OR("uncontrolled", "treatment")